雷射虹膜穿孔術（laser iridotomy）適用於下列那類型的青光眼？
A. 瞳孔阻斷（pupillary block）之隅角閉鎖型青光眼
B. 隅角開放性青光眼
C. 使用類固醇導致之續發性青光眼
D. 任何類型的青光眼均適用

正確答案：A. 瞳孔阻斷（pupillary block）之隅角閉鎖型青光眼